allergies to medications used in the study

The above is a clinical trial exclusion criterion. Annotated with entity spans:
[Condition: allergies] to [Drug: medications] [Qualifier: used in the study]